Clinical trial exclusion criterion:
History of malignancy including leukemia and lymphoma within recent 5 years except for localized basal cell carcinoma of the skin)

Entity relations:
- Has_temporal("malignancy", "History of")
- Has_negation("localized basal cell carcinoma of the skin", "except for")
- Subsumes("malignancy", "leukemia")
- AND("malignancy", "localized basal cell carcinoma of the skin")
- Has_temporal("malignancy", "within recent 5 years")
- OR("leukemia", "lymphoma")